Clinical trial exclusion criterion:
allergy to eggs

Annotated entities:
- Condition: "allergy"
- Drug: "eggs"